一位 34 歲經產孕婦，目前懷第二胎，妊娠第 35 週；這位婦女於 3 年前懷第一胎，於妊娠第 36 週，接受產前乙型鏈球菌（GBS）篩檢，結果呈現乙型鏈球菌菌落陽性反應。她於第一胎待產時接受預防性抗生素注射治療，胎兒出生後並無新生兒乙型鏈球菌感染現象發生。為預防第二胎新生兒乙型鏈球菌感染，應採取的作法為：
A. 不必安排產前乙型鏈球菌篩檢，待產時直接採取預防性抗生素注射治療措施
B. 安排產前乙型鏈球菌篩檢，若呈現乙型鏈球菌菌落陽性反應，則於待產時採取預防性抗生素注射治療措施
C. 安排剖腹生產，手術前採取預防性抗生素注射治療措施
D. 安排剖腹生產，不必採取預防性抗生素注射治療措施

正確答案：B. 安排產前乙型鏈球菌篩檢，若呈現乙型鏈球菌菌落陽性反應，則於待產時採取預防性抗生素注射治療措施